Clinical trial inclusion criterion:
3. Traumatic and non-traumatic, non-progressive lesions

Entity relations:
- Has_qualifier("lesions", "non-progressive")
- Has_qualifier("lesions", "non-traumatic")
- Has_qualifier("lesions", "Traumatic")